下列何者不是典型嚴重氣喘患童之肺功能測量儀（spirometry）測量結果？（FVC：forced vital capacity全力吐氣量；FEV1：forced expiratory volume at one second一秒全力吐氣量。）
A. FEV1/ FVC比值＜0.80
B. 支氣管擴張反應FEV1改善值≧12%
C. 運動激發試	FEV1值下降≧15%
D. 每天晨間和晚間FEV1變異度≦20%

正確答案：D. 每天晨間和晚間FEV1變異度≦20%